一位 64 歲男性患有嚴重憂鬱症，被送至開刀房進行電擊治療，下列敘述何者錯誤？
A. 進行電擊治療時，麻醉醫師需全程處理病患呼吸道與心血管問題
B. 最近 3 個月發生心肌梗塞為進行電擊治療的禁忌症之一
C. 使用靜脈麻醉劑（如 barbiturates）作為誘導時，應與一般手術病患一樣的劑量
D. Succinylcholine 為最常選擇使用之肌肉鬆弛劑

正確答案：C. 使用靜脈麻醉劑（如 barbiturates）作為誘導時，應與一般手術病患一樣的劑量